Any patient who, in the opinion of the Investigator, is not a good candidate for the study or will not be able to follow study procedures.

The above is a clinical trial exclusion criterion. Annotated with entity spans:
[Non-query-able: Any patient who, in the opinion of the Investigator, is not a good candidate for the study or will not be able to follow study procedures].